Regular use of any nonsteroidal antiinflammatory drug,

The above is a clinical trial exclusion criterion. Annotated with entity spans:
[Multiplier: Regular use] of any [Condition: nonsteroidal antiinflammatory drug],